女性 granulosa cell tumor 的腫瘤標記（tumor marker）為何？
A. inhibin
B. CA-19-9
C. LDH
D. CA-125

正確答案：A. inhibin